Which one was the first chromone in clinical use?

The first chromone in clinical use, khellin.